有關子宮內膜異位症的敘述，下列何者錯誤？
A. 可能引起骨盆疼痛或不孕
B. 診斷主要靠組織切片，切片若未發現子宮內膜異位組織，也不能排除子宮內膜異位症
C. 美國生殖醫學會（ASRM）將子宮內膜異位，依疼痛的嚴重程度分為第一期到第四期
D. 子宮內膜異位症與卵巢癌有關

正確答案：C. 美國生殖醫學會（ASRM）將子宮內膜異位，依疼痛的嚴重程度分為第一期到第四期